Acute or severe medical illness, i.e., delirium, metastatic cancer, decompensated cardiac, liver or kidney failure, major surgery, stroke or myocardial infarction during the three months prior to entry; or use of drugs known to cause depression, e.g., reserpine, alpha-methyl-dopa, steroids, sympathomimetics withdrawal;

The above is a clinical trial exclusion criterion. Annotated with entity spans:
[Qualifier: Acute] or [Qualifier: severe] [Condition: medical illness], i.e., [Condition: delirium], [Condition: metastatic cancer], [Qualifier: decompensated] [Condition: cardiac], [Condition: liver] or [Condition: kidney failure], [Procedure: major surgery], [Condition: stroke] or [Condition: myocardial infarction] during the [Temporal: three months prior to entry]; or use of [Drug: drugs] known to cause [Condition: depression], e.g., [Drug: reserpine], [Drug: alpha-methyl-dopa], [Drug: steroids], [Condition: sympathomimetics withdrawal];